Clinical trial inclusion criterion:
Subjects undergoing treatment of statin for hypercholesterolemia

Entity relations:
- AND("treatment", "statin")
- AND("treatment", "hypercholesterolemia")